¿Cuál de los siguientes fármacos NO se emplea en el tratamiento de la hepatitis autoinmune?
1. Prednisona.
2. Azatioprina.
3. Budesonida.
4. Lamivudina.
5. Micofenolato mofetil.

Respuesta correcta: 4. Lamivudina.